Clinical trial exclusion criterion:
11. Stroke or transient ischemic attack within the prior 3 months.

Entity relations:
- Has_temporal("Stroke", "within the prior 3 months")
- OR("Stroke", "transient ischemic attack")